Clinical trial exclusion criterion:
2. Patients who received ATG, Campath, or other T cell immunosuppressive monoclonal antibodies in the last 28 days

Annotated entities:
- Parsing_Error: "2."
- Drug: "ATG"
- Drug: "Campath"
- Drug: "T cell immunosuppressive monoclonal antibodies"
- Temporal: "in the last 28 days"